Clinical trial inclusion criterion:
Heart rate 55-100 beats per minute

Entity relations:
- Has_value("Heart rate", "55-100 beats per minute")